Pregnant females as determined by positive serum hCG test at screening or prior to dosing.

The above is a clinical trial exclusion criterion. Annotated with entity spans:
[Condition: Pregnant] [Person: females] as determined by [Value: positive] [Measurement: serum hCG test] [Temporal: at screening] or [Temporal: prior to dosing].